Clinical trial exclusion criterion:
Active bleeding without control;

Annotated entities:
- Condition: "bleeding"
- Qualifier: "Active"